En la capa más próxima al epitelio pigmentario de la retina están las células:
1. Ganglionares.
2. Conos y bastones.
3. Amacrinas.
4. Bipolares.
5. Horizontales.

Respuesta correcta: 2. Conos y bastones.